Clinical trial inclusion criterion:
Systemic sclerosis meeting the EULAR criteria.

Annotated entities:
- Condition: "Systemic sclerosis"
- Measurement: "EULAR criteria"
- Value: "meeting"